有關思覺失調症（schizophrenia）之預後，下列何者是預後較好的因子？
A. 病發前無誘發因子（precipitating factor）
B. 負性症狀（negative symptoms）
C. 較早發病
D. 憂鬱症狀

正確答案：D. 憂鬱症狀